下列何種輔酶（coenzyme）不參與α-ketoglutarate轉換成succinyl-CoA之氧化脫羧反應 （oxidative decarboxylation）？
A. Thiamine pyrophosphate
B. Tetrahydrofolate
C. FAD
D. Coenzyme A

正確答案：B. Tetrahydrofolate